Clinical trial exclusion criterion:
Patients that are known to be positive for Human Immunodeficiency Virus (HIV) (HIV 1/2 antibodies), active Hepatitis B (HBsAg reactive), or Hepatitis C (HCV RNA [qualitative] is detected); patients with negative Hepatitis C antibody testing may not need RNA testing.

Annotated entities:
- Measurement: "Human Immunodeficiency Virus (HIV)"
- Value: "positive"
- Qualifier: "HIV 1/2 antibodies"
- Condition: "active Hepatitis B"
- Measurement: "HBsAg"
- Value: "reactive"
- Condition: "Hepatitis C"
- Measurement: "HCV RNA [qualitative]"
- Value: "detected"
- Measurement: "Hepatitis C antibody"
- Value: "negative"
- Non-query-able: "patients with negative Hepatitis C antibody testing may not need RNA testing"
- Not_a_criteria: "patients with negative Hepatitis C antibody testing may not need RNA testing"